下列何者不是造成急性呼吸窘迫症（acute respiratory distress syndrome）的原因？
A. 溺水（near-drowning）
B. 胃含物吸入（aspiration of gastric contents）
C. 有機磷中毒（organophosphate intoxication）
D. 吸入性傷害（inhalation injury）

正確答案：C. 有機磷中毒（organophosphate intoxication）